¿Qué fármaco debe recomendarse para el tratamiento de la epilepsia mioclónica juvenil?
1. Fenobarbital.
2. Acido Valproico.
3. Oxcarbacepina.
4. Difenilhidantoína.
5. Topiramato.

Respuesta correcta: 2. Acido Valproico.